一位 46 歲女性，於右側乳房外上方，離乳頭 2 公分處，發現一大小約 2 公分之硬塊。乳房攝影檢查顯示一邊緣不規則之腫瘤，合併微小鈣化點延伸至乳頭下方，粗針（core needle）穿刺切片檢查證實為浸潤性乳管癌（infiltrating ductal carcinoma）。下列何者為最不合適之手術治療方式？
A. 改良式乳癌根除手術（modified radical mastectomy）
B. 乳房全切除術＋腋下哨兵淋巴結切片手術（total mastectomy＋axillary sentinel lymph node biopsy）
C. 皮膚保留乳癌根除術合併乳房重建手術（skin sparing radical mastectomy＋breast reconstruction surgery）
D. 乳房保留手術（breast conserving surgery）

正確答案：D. 乳房保留手術（breast conserving surgery）